Clinical trial inclusion criterion:
• History of uveitis confirmed by an ophthalmologist

Entity relations:
- Has_temporal("uveitis", "History")